Involved in workers' compensation or active litigation involving affected shoulder

The above is a clinical trial exclusion criterion. Annotated with entity spans:
[Non-query-able: Involved in workers' compensation or active litigation involving affected shoulder]